澱粉樣變性病（amyloidosis）是一類由蛋白質摺疊錯誤所引發的疾病，何種蛋白質二級結構（secondary structure）與導致此類疾病的關係最為密切？
A. α-螺旋（α-helix）
B. β-摺板（β-sheet）
C. β-回轉（β-turn）
D. 隨機線圈（random coil）

正確答案：B. β-摺板（β-sheet）